髓芽細胞瘤（medulloblastoma, WHO grade IV）是一好發於兒童小腦，分化差之中樞神經腫瘤。其腫瘤分子 分類（molecular subtype）中，何者預後最佳？
A. the WNT type
B. the SHH type
C. group 3 medulloblastoma
D. group 4 medulloblastoma

正確答案：A. the WNT type